Clinical trial exclusion criterion:
Subject with cardiac pacemaker or other implanted electromedical device.

Annotated entities:
- Device: "cardiac pacemaker"
- Device: "implanted electromedical device"